下列有關脊髓空洞症（syringomyelia）的敘述，何者錯誤？
A. 症狀類似中央脊髓症候群（central cord syndrome）
B. 感覺喪失以本體感覺（proprioceptive）為主，痛及觸覺正常
C. 上肢較下肢無力
D. 核磁共振掃描（MRI）是檢查選擇之一

正確答案：B. 感覺喪失以本體感覺（proprioceptive）為主，痛及觸覺正常